下列關於 lidocaine 之敘述，何者錯誤？
A. 屬於 amide 類局部麻醉劑
B. 水溶性較 bupivacaine 小
C. 具有神經毒性（neurotoxicity）
D. 具有中樞抑制作用

正確答案：B. 水溶性較 bupivacaine 小